Clinical trial inclusion criterion:
Overweight/Obese Adult patients (age 19 years -65)

Entity relations:
- Has_value("age", "19 years -65")
- Subsumes("Adult", "age")
- OR("Overweight", "Obese")